Clinical trial exclusion criterion:
Active ischemia (acute thrombus diagnosed by coronary angiography, or dynamic ST segment changes demonstrated on ECG) or another reversible cause of VT (e.g. drug-induced arrhythmia), had recent acute coronary syndrome within 30 days, coronary revascularization (<90 days bypass surgery, <30 days percutaneous coronary intervention), or have CCS functional class IV angina. Note that biomarker level elevation alone after ventricular arrhythmias does not denote acute coronary syndrome or active ischemia.

Entity relations:
- Has_qualifier("ischemia", "Active")
- AND("coronary angiography", "acute thrombus")
- AND("ECG", "ST segment changes")
- Has_qualifier("VT", "reversible")
- Subsumes("VT", "drug-induced arrhythmia")
- Has_temporal("acute coronary syndrome", "within 30 days,")
- Has_temporal("bypass surgery", "<90 days")
- Has_temporal("percutaneous coronary intervention", "<30 days")
- Subsumes("coronary revascularization", "bypass surgery")
- Has_value("CCS functional class", "IV")
- AND("angina", "CCS functional class")
- Subsumes("ischemia", "coronary angiography")
- Subsumes("coronary revascularization", "percutaneous coronary intervention")
- Subsumes("ischemia", "ECG")
- Subsumes("ischemia", "VT")
- Subsumes("ischemia", "acute coronary syndrome")
- Subsumes("ischemia", "coronary revascularization")
- OR("ischemia", "angina")